下列那一種抗憂鬱藥物較不容易產生姿勢性低血壓的副作用？
A. Desipramine
B. Trazodone
C. Fluoxetine
D. Amitriptyline

正確答案：C. Fluoxetine